Clinical trial exclusion criterion:
Guillain-Barré syndrome within eight weeks of a previous influenza vaccine

Annotated entities:
- Condition: "Guillain-Barré syndrome"
- Temporal: "within eight weeks of a previous influenza vaccine"
- Reference_point: "a previous influenza vaccine"
- Temporal: "previous"
- Drug: "influenza vaccine"